barrier contraceptives (condom, diaphragm with spermicide)

The above is a clinical trial inclusion criterion. Annotated with entity spans:
[Device: barrier contraceptives] ([Device: condom], [Device: diaphragm] [Qualifier: with spermicide])